Clinical trial exclusion criterion:
Pregnant women or women who are uncertain about a possible pregnancy

Annotated entities:
- Condition: "Pregnant"
- Observation: "possible pregnancy"
- Non-query-able: "uncertain about a possible pregnancy"